Any clinically significant acute or chronic medical condition requiring care by a primary care provider (e.g., diabetes, coronary artery disease, rheumatologic illness, malignancy, substance abuse) that, in the opinion of the investigator, would preclude participation

The above is a clinical trial exclusion criterion. Annotated with entity spans:
Any clinically significant acute or chronic medical condition requiring care by a primary care provider (e.g., [Condition: diabetes], [Condition: coronary artery disease], [Condition: rheumatologic illness], [Condition: malignancy], [Condition: substance abuse]) that, in the opinion of the investigator, would preclude participation